source of infection: blood, respiratory, intra abdominal or urinary

The above is a clinical trial inclusion criterion. Annotated with entity spans:
[Non-representable: source of infection: blood, respiratory, intra abdominal or urinary]